any confirmed or suspected immunodeficiency condition, including human immunodeficiency virus (HIV) infection, haematological malignancy, or a congenital immunodeficiency

The above is a clinical trial exclusion criterion. Annotated with entity spans:
any [Qualifier: confirmed] or [Qualifier: suspected] [Condition: immunodeficiency condition], including [Condition: human immunodeficiency virus] ([Condition: HIV]) infection, [Condition: haematological malignancy], or a [Condition: congenital immunodeficiency]